Clinical trial exclusion criterion:
a disease that might affect hepatic or renal function, contraindications to opioid analgesics, fetal growth retardation, signs of fetal asphyxia by cardiotocography, meconium stained amniotic fluid or placental insufficiency. The subjects should not have received fentanyl during the previous 14 days.

Entity relations:
- AND("contraindications", "opioid analgesics")
- Has_mood("fetal asphyxia", "signs of")
- AND("fetal asphyxia", "cardiotocography")
- Has_qualifier("disease", "affect renal function")
- Has_temporal("fentanyl", "during the previous 14 days")
- Has_negation("fentanyl", "not")
- OR("affect renal function", "affect hepatic function")
- OR("disease", "placental insufficiency", "fetal asphyxia", "fetal growth retardation", "contraindications", "meconium stained amniotic fluid")